Clinical trial exclusion criterion:
Smoking;

Annotated entities:
- Observation: "Smoking"